Clinical trial exclusion criterion:
Past history of hypersensitivity to the study drug;

Entity relations:
- AND("hypersensitivity", "study drug")